Clinical trial exclusion criterion:
Long term use of aspirin or P2Y12 receptor antagonist within 1month

Entity relations:
- Has_qualifier("aspirin", "Long term")
- Has_temporal("aspirin", "within 1month")
- OR("aspirin", "P2Y12 receptor antagonist")